Las cepas de Streptococcus pyogenes productoras de toxina eritrogénica, son responsables de:
1. Erisipela.
2. Fiebre reumática.
3. Impétigo.
4. Glomerulonefritis.
5. Escarlatina.

Respuesta correcta: 5. Escarlatina.